Which genes does thyroid hormone receptor beta1 regulate in the liver?

LDL receptor"//
"ChREBP"//
"ME", "malic enzyme"//
"cytochrome P450 oxidoreductase"//